Clinical trial inclusion criterion:
Measureable disease defined as: ≥ 1 lesion ≥ 1.5 cm single dimension via CT, CT/PET with nodal or mass lesions; Quantifiable circulating tumor cells; or for Waldenström's macroglobulinemia presence of IgM l > 2X ULN; For CTCL: mSWAT > 0

Entity relations:
- Has_value("≥ 1.5 cm single dimension", "≥ 1.5 cm")
- Has_value("IgM l", "> 2X ULN")
- Has_value("mSWAT", "> 0")
- AND("CTCL", "mSWAT")
- AND("Waldenström's macroglobulinemia", "IgM l")
- AND("≥ 1.5 cm single dimension", "CT")
- AND("CT", "nodal lesions")
- Subsumes("Measureable disease", "≥ 1 lesion")
- Subsumes("Measureable disease", "≥ 1.5 cm single dimension")
- Subsumes("Measureable disease", "circulating tumor cells")
- OR("nodal lesions", "mass lesions")
- OR("CT", "CT/PET")
- OR("circulating tumor cells", "Waldenström's macroglobulinemia", "CTCL")